Clinical trial exclusion criterion:
History of steroid or immunosuppressive drug use within 6 months of surgery

Entity relations:
- Has_index("within 6 months of surgery", "surgery")
- Has_temporal("steroid", "within 6 months of surgery")
- OR("steroid", "immunosuppressive drug")